Patients with known or suspected hypersensitivity to the used medication were also excluded from the study.

The above is a clinical trial exclusion criterion. Annotated with entity spans:
Patients with [Mood: known] or [Mood: suspected] [Condition: hypersensitivity] to the [Drug: used medication] were also excluded from the study.